Insulin treated diabetes

The above is a clinical trial exclusion criterion. Annotated with entity spans:
[Qualifier: Insulin treated] [Condition: diabetes]